Established pre-existing diabetes (including unrecognised diabetes defined as a fasting plasma glucose = 7.0mmol/L and/ or HbA1c = 48mmol/mol); Contraindications to metformin therapy (creatinine = 130µmol/L/ alanine transaminase = 2.0 x upper limit normal/ previous intolerance to metformin)

The above is a clinical trial exclusion criterion. Annotated with entity spans:
Established pre-existing [Condition: diabetes] (including unrecognised diabetes defined as a [Measurement: fasting plasma glucose] [Value: = 7.0mmol/L] and/ or [Measurement: HbA1c] [Value: = 48mmol/mol)]; [Condition: Contraindications] to [Drug: metformin] therapy ([Measurement: creatinine] [Value: = 130µmol/L/] [Measurement: alanine transaminase] [Value: = 2.0 x upper limit normal]/ previous [Condition: intolerance] to [Drug: metformin])